¿A qué nos referimos cuando un médico cree con firmeza en su tratamiento, a pesar de que los estudios controlados hayan demostrado su ineficacia, los resultados que obtenga con el mismo serán mejores, sus pacientes se encontrarán mejor, y tendrá más pacientes?
1. El proceso oponente de Solomon.
2. El efecto suelo.
3. La paradoja de Asher.
4. El efecto de contemplación de Prochaska.
5. La teoría de la puerta de control.

Respuesta correcta: 3. La paradoja de Asher.